Clinical trial exclusion criterion:
HIV positivity

Annotated entities:
- Condition: "HIV positivity"
- Measurement: "HIV"
- Value: "positivity"